El gasto cardiaco (CG) aumenta entre el 40 y el 50% durante el embarazo. ¿Cuándo vuelve a valores normales?
1. Una semana antes del parto.
2. Durante el trabajo del parto.
3. Siete a diez días después del parto.
4. Al final del puerperio.
5. Al finalizar la lactancia.

Respuesta correcta: 3. Siete a diez días después del parto.